Clinical trial inclusion criterion:
Agreement to the trial protocol, including the randomized manner

Entity relations:
- OR("Agreement to the trial protocol", "Agreement to the randomized manner")